下列那一種口服降血糖藥物的作用機轉是刺激胰島素分泌？
A. Metformin
B. Acarbose
C. Pioglitazone
D. Repaglinide

正確答案：D. Repaglinide